Un paciente es diagnosticado de un cáncer de pulmón de 4 cm sin contacto pleural en el lóbulo superior derecho. El estudio de extensión pone de manifiesto la presencia de metástasis en ganglios parahiliares derechos, sin evidencia de metástasis a distancia. El estadiaje del tumor será:
1. Estadio I.
2. Estadio IIA.
3. Estadio IIB.
4. Estadio IIIA.
5. Estadio IIIB.

Respuesta correcta: 2. Estadio IIA.